En general, los virus que poseen una cápside desnuda:
1. Son estables frente a la desecación.
2. Comúnmente se liberan de la célula huésped por gemación.
3. Son muy sensibles a los detergentes.
4. Son muy sensibles a las condiciones existentes en el tracto intestinal.
5. No pueden ser neutralizados por los anticuerpos del huésped.

Respuesta correcta: 1. Son estables frente a la desecación.